下列有關周邊性眩暈（peripheral vertigo）及中樞性眩暈（central vertigo）的鑑別診斷之敘述，何者正確？
A. 中樞性眩暈的病人其眩暈通常較為溫和，但周邊性眩暈的病人其眩暈通常較強烈
B. 眼睛直視不轉動（visual fixation）可以抑制中樞性眩暈病人的眼球震顫及眩暈，但無法抑
C. 中樞性眩暈的病人常同時有耳鳴或失聰，而周邊性眩暈的病人很少有耳鳴
D. 中樞性眩暈的病人不會有垂直眼球震顫（vertical nystagmus），而周邊性眩暈的病人常有垂直眼球震顫

正確答案：A. 中樞性眩暈的病人其眩暈通常較為溫和，但周邊性眩暈的病人其眩暈通常較強烈